Clinical trial exclusion criterion:
h/o stroke

Annotated entities:
- Condition: "stroke"